退伍軍人病（Legionnaire's disease）最常見的感染原是：
A. 健康帶菌者
B. 發病中的病人
C. 帶菌的氣霧
D. 受感染的家禽

正確答案：C. 帶菌的氣霧